Clinical trial inclusion criterion:
Caucasian male or female patient

Entity relations:
- OR("male", "female")